Clinical trial exclusion criterion:
Contralateral phrenic nerve palsy

Annotated entities:
- Qualifier: "Contralateral"
- Condition: "phrenic nerve palsy"